The common house cat, Felis silvestris catus and the domestic dog, Canis familiaris both belong to what taxonomic order?

The common house cat and domestic dog both belong to the order Carnivora in the class Mammalia